Clinical trial exclusion criterion:
Unwillingness to tolerate menstrual irregularity

Annotated entities:
- Condition: "menstrual irregularity"
- Mood: "Unwillingness to tolerate"